Clinical trial inclusion criterion:
Cytologically proven acute lymphoblastic leukemia (ALL)

Annotated entities:
- Condition: "acute lymphoblastic leukemia"
- Condition: "ALL"
- Qualifier: "Cytologically proven"